副睪（epididymis）之內襯上皮屬於：
A. 偽複層柱狀上皮（pseudostratified columnar epithelium ）
B. 複層扁平上皮（stratified squamous epithelium）
C. 多層柱狀上皮（stratified columnar epithelium）
D. 移形上皮（transitional epithelium）

正確答案：A. 偽複層柱狀上皮（pseudostratified columnar epithelium ）